有失能（disability）的病患，在接受復健治療時需要注意的重點，不包括下列何者？
A. 因每個病患的失能程度不一樣，因此復健治療必須依照每人的不同量身安排（individualized）
B. 必須注意復健環境（environmental factors），例如無障礙空間等
C. 必須好好教育家屬（adequate family education）
D. 應採取一對一復健方式，暫時不要讓病患跟太多其他病患有社會互動（social interaction）

正確答案：D. 應採取一對一復健方式，暫時不要讓病患跟太多其他病患有社會互動（social interaction）